下列會引起肌肉萎縮的疾病中，那一個會同時有肌腱反射上升的現象？
A. amyotrophic lateral sclerosis
B. myotonic dystrophy
C. porphyric neuropathy
D. polymyositis

正確答案：A. amyotrophic lateral sclerosis